Clinical trial exclusion criterion:
Regularly taking prescribed analgesia

Annotated entities:
- Drug: "analgesia"
- Qualifier: "Regularly"